在做肺臟復健運動訓練時，若發現病患血氧分壓為下列何者時可考慮同時給予氧氣？
A. 81～91 mmHg
B. 71～80 mmHg
C. 61～70 mmHg
D. ≦60 mmHg

正確答案：D. ≦60 mmHg